Clinical trial exclusion criterion:
Hemoglobin (Hb) < 8 g/dL

Annotated entities:
- Measurement: "Hemoglobin"
- Measurement: "Hb"
- Value: "< 8 g/dL"